Clinical trial inclusion criterion:
Capability to understand the Informed Consent Form;

Annotated entities:
- Non-query-able: "Capability to understand the Informed Consent Form;"
- Post-eligibility: "Capability to understand the Informed Consent Form;"